Clinical trial exclusion criterion:
Earlier operations in the foot and leg, that is judged to complicate training

Annotated entities:
- Non-query-able: "Earlier operations in the foot and leg, that is judged to complicate training"